成年人之腎病症候群（nephrotic syndrome），若腎臟病理變化為極微變化型腎病變（minimal change disease），其特殊治療之第一線藥物應為下列那一種？
A. cyclophosphamide
B. cyclosporine
C. chlorambucil
D. prednisolone

正確答案：D. prednisolone